Clinical trial inclusion criterion:
Alanine aminotransferase (ALT) and aspartate aminotransferase (AST) ≤2.5 times the upper limit of normal if no liver involvement or ≤5 times the upper limit of normal with liver involvement.

Entity relations:
- Has_negation("liver involvement", "no")
- Has_value("liver involvement.", "≤5 times the upper limit of normal")
- Has_value("liver involvement", "≤2.5 times the upper limit of normal")
- AND("aspartate aminotransferase (AST)", "liver involvement")
- AND("Alanine aminotransferase (ALT)", "liver involvement")
- OR("liver involvement", "liver involvement.")